下列有關肺門（hilum of the lung）之敘述，何者正確？
A. 肺動脈位於左肺門最上方
B. 支氣管位於左肺門最下方
C. 肺靜脈位於右肺門最上方
D. 支氣管位於右肺門最前方

正確答案：A. 肺動脈位於左肺門最上方